下列有關睪丸癌之敘述何者錯誤？
A. 約 7～10%睪丸癌發生於曾有隱睪症病史之病人
B. 睪丸淋巴引流由 L4 延伸至 T1 高度
C. IIA 期與 IIB 期之分野為淋巴結大小 2 公分
D. seminoma 為唯一血清 hCG 會升高之睪丸癌

正確答案：D. seminoma 為唯一血清 hCG 會升高之睪丸癌